Clinical trial inclusion criterion:
S. aureus on at least 1 blood culture within 72 hours of beginning study drug (Cohort A) OR

Entity relations:
- Has_context("blood culture", "S. aureus")
- Has_multiplier("blood culture", "at least 1")
- Has_index("within 72 hours of beginning study drug", "beginning study drug")
- Has_temporal("blood culture", "within 72 hours of beginning study drug")